Clinical trial inclusion criterion:
Eastern Cooperative Oncology Group (ECOG) performance status and/or other performance status 0, 1, or 2 at time of enrollment.

Annotated entities:
- Measurement: "Eastern Cooperative Oncology Group (ECOG) performance status"
- Value: "0, 1, or 2"
- Temporal: "at time of enrollment"